Clinical trial exclusion criterion:
Fasting plasma glucose > 7,0 mM, HbA1c > 48 mmol/mol 3 months after RYGB.

Annotated entities:
- Measurement: "Fasting plasma glucose"
- Value: "> 7,0 mM"
- Measurement: "HbA1c"
- Value: "> 48 mmol/mol"
- Temporal: "3 months after RYGB"
- Procedure: "RYGB"
- Reference_point: "RYGB"